requirement for oxygen therapy at low altitude residence

The above is a clinical trial exclusion criterion. Annotated with entity spans:
requirement for [Procedure: oxygen therapy] at low altitude residence